En una especie animal, el valor de la constante de velocidad de eliminación de un fármaco con comportamiento farmacocinético lineal, depende de:
1. La vía de administración.
2. La dosis de fármaco administrada.
3. El porcentaje de dosis administrada que llega en forma inalterada a circulación general.
4. La velocidad a la que el fármaco llega a circulación sistémica.
5. La distribución y eliminación del fármaco.

Respuesta correcta: 5. La distribución y eliminación del fármaco.